下列有關風濕熱（rheumatic fever）之敘述，何者錯誤？
A. group A β-hemolytic streptococcus 感染為致病原因
B. 約 40~80%會發生心臟炎（carditis），若侵犯瓣膜，以二尖瓣（mitral valve）最常見
C. 多發性關節炎（polyarthritis）為最常見的臨床表現，主要侵犯小關節（small joints）
D. 其致病機轉可能牽涉自體免疫（autoimmune）機制

正確答案：C. 多發性關節炎（polyarthritis）為最常見的臨床表現，主要侵犯小關節（small joints）